膿性指頭炎（whitlow）是由那一種病毒所引起？
A. Cytomegalovirus
B. Herpes simplex virus
C. Human papillomavirus
D. Human herpesvirus-6

正確答案：B. Herpes simplex virus